Stable body weight during the previous 6 months, based on Investigator judgment.

The above is a clinical trial inclusion criterion. Annotated with entity spans:
[Qualifier: Stable] [Measurement: body weight] [Temporal: during the previous 6 months], [Subjective_judgement: based on Investigator judgment].